Un aspecto esencial que se debe incluir en la valoración de una persona fumadora es:
1. Grado de dependencia.
2. Estadio del proceso de cambio.
3. Grado de motivación.
4. Apoyos y dificultades.
5. Todas son correctas.

Respuesta correcta: 5. Todas son correctas.